Clinical trial exclusion criterion:
inability to tolerate small, enclosed spaces without anxiety (e.g. claustrophobia), as determined by self-report and/or a preliminary session in a mock scanner

Annotated entities:
- Condition: "claustrophobia"
- Condition: "tolerate small, enclosed spaces without anxiety"
- Mood: "inability"
- Negation: "inability"
- Procedure: "self-report"